Clinical trial exclusion criterion:
10. History of alcohol abuse or other substance abuse within the last year.

Entity relations:
- Has_temporal("alcohol abuse", "within the last year")
- OR("alcohol abuse", "substance abuse")